Clinical trial inclusion criterion:
Blood culture-proven typhoid fever (S. typhi or S. paratyphi)

Entity relations:
- Has_value("Blood culture", "proven")
- AND("typhoid fever", "Blood culture")
- Subsumes("typhoid fever", "S. typhi")
- OR("S. typhi", "S. paratyphi")